婦女骨盆底肌肉中，下列那一群肌肉較易受到經陰道生產時的損傷？
A. coccygeus muscle
B. iliorectalis muscle
C. pubococcygeus muscle
D. anal sphincter muscle

正確答案：C. pubococcygeus muscle